Clinical trial exclusion criterion:
Evidence of blood dyscrasia

Entity relations:
- Has_mood("blood dyscrasia", "Evidence")